Clinical trial inclusion criterion:
Have a planned non-emergent surgical procedure or clinical situation (e.g., intubation) that requires moderate or deep NMB with either rocuronium or vecuronium.

Annotated entities:
- Mood: "planned"
- Qualifier: "non-emergent"
- Procedure: "surgical procedure"
- Condition: "clinical situation"
- Procedure: "intubation"
- Procedure: "NMB"
- Qualifier: "moderate"
- Qualifier: "deep"
- Drug: "rocuronium"
- Drug: "vecuronium"